Clinical trial inclusion criterion:
Availability to undergo treatment and return for follow up visits at specified post-operative intervals

Annotated entities:
- Non-query-able: "Availability to undergo treatment and return for follow up visits at specified post-operative intervals"